Clinical trial exclusion criterion:
Current history or in past 6 months of psychotic disorder or major depressive disorders that is not stable on treatment for past 3 months

Annotated entities:
- Condition: "psychotic disorder"
- Condition: "major depressive disorders"
- Qualifier: "not stable"
- Temporal: "for past 3 months"
- Temporal: "past 6 months"